Clinical trial exclusion criterion:
severe behavioral issues

Entity relations:
- Has_qualifier("behavioral issues", "severe")